下列何者是心肌細胞和平滑肌細胞皆有的構造？
A. 三聯體（triad）
B. 緻密體（dense body）
C. 緊密接合（tight junction）
D. 間隙接合（gap junction）

正確答案：D. 間隙接合（gap junction）